Which clinical trials led to the first approval of Volanesorsen by the EU?

The approval of Volanesorsen by the EU was based on the positive results from the multinational, phase III APPROACH and COMPASS studies.